Which R/bioconductor package exists for discovery of intergenic transcripts?

PRAM is a novel pooling approach for discoveries of intergenic transcripts from large-scale RNA sequencing experiments.